有關重度失能病患復健上常見心理問題的敘述，下列何者錯誤？
A. 否認（denial）是復健常見心理問題，但非單一現象
B. 憂鬱（depression）與焦慮（anxiety）都是復健常見心理問題
C. 脊髓損傷病人的憂鬱問題比焦慮問題更為常見
D. 中風病人的憂鬱問題比焦慮問題更為常見

正確答案：C. 脊髓損傷病人的憂鬱問題比焦慮問題更為常見